腦中風導致的上肢屈曲協同（flexor synergy）動作不包括下列何者？
A. 肩外展（shoulder abduction）
B. 肘屈曲（elbow flexion）
C. 前臂旋前（forearm pronation）
D. 腕屈曲（wrist flexion）

正確答案：C. 前臂旋前（forearm pronation）